Septic or hypovolemic shock

The above is a clinical trial exclusion criterion. Annotated with entity spans:
[Condition: Septic] or [Condition: hypovolemic shock]